Clinical trial exclusion criterion:
Contraindication to peripheral nerve blockade or general anesthesia including:

Annotated entities:
- Condition: "Contraindication to peripheral nerve blockade"
- Condition: "Contraindication to general anesthesia"